一位 28 歲婦女連續經歷三次懷孕初期（<12 weeks）之胚胎死亡，下列何者不屬於該婦女必要的評估項目？
A. 夫妻染色體檢查
B. 子宮輸卵管攝影（或子宮立體超音波檢查）
C. 飯前血糖及甲狀腺機能
D. 陰道及骨盆腔 Chlamydia trachomatis 感染

正確答案：D. 陰道及骨盆腔 Chlamydia trachomatis 感染